身體診查發現乳房出現橘子皮變化（peau d'orange 或 orange peel appearance）時，下列敘述何者錯誤？
A. 此變化乃因癌細胞阻塞皮下淋巴循環造成
B. Stage I 乳癌不會有此表現
C. 有可能是發炎性乳癌（inflammatory breast cancer）
D. 應給予抗生素

正確答案：D. 應給予抗生素